Diagnosed hepato-biliary disease/inflammation

The above is a clinical trial inclusion criterion. Annotated with entity spans:
Diagnosed [Condition: hepato-biliary disease]/inflammation